Clinical trial exclusion criterion:
Diagnosis of other active, ongoing skin diseases or skin infections that may interfere with examination of psoriasis lesions

Annotated entities:
- Qualifier: "active"
- Temporal: "ongoing"
- Condition: "skin diseases"
- Condition: "skin infections"
- Non-representable: "interfere with examination of psoriasis lesions"